Clinical trial exclusion criterion:
metal implants / objects in the body that may interfere with MRI

Entity relations:
- Has_mood("MRI", "may interfere with")
- AND("metal implants", "MRI")
- OR("metal implants", "metal objects")